下列何者的形成與腹內斜肌（internal oblique muscle）最有關？
A. 腹股溝深環（deep inguinal ring）
B. 精索內筋膜（internal spermastic fascia）
C. 腔隙韌帶（lacunar ligament）
D. 聯合腱（conjoint tendon）

正確答案：D. 聯合腱（conjoint tendon）